Clinical trial exclusion criterion:
Patient included in an interventional study assessing treatment for active proctitis or distal proctosigmoiditis.

Entity relations:
- AND("treatment", "active proctitis")
- OR("active proctitis", "distal proctosigmoiditis")